Clinical trial exclusion criterion:
Internal, neurologic, rheumatologic or psychiatric disease including current heavy smoking (>20 cigarettes per day)

Entity relations:
- Has_multiplier("heavy smoking", ">20 cigarettes per day")
- OR("Internal disease", "neurologic disease", "rheumatologic disease", "heavy smoking", "psychiatric disease")